一位 1 歲男童因最近時常瘀青來就診，病童檢驗報告如下 WBC：8,700/mm3、Hgb：12 gm/dL、 7/10.8（patient/control）秒、activated partial thromboplastin time（aPTT）：89.3/29.6（patient/control）秒、bleeding time（Ivy's method）：1.5 min、von Willebrand factor（vWF）antigen 72%，此病童最有可能是：
A. 第七凝固因子缺乏
B. 血友病 B（hemophilia B）
C. von Willebrand 病
D. 尿毒症（uremia）

正確答案：B. 血友病 B（hemophilia B）